9. Women currently using narcotics

The above is a clinical trial exclusion criterion. Annotated with entity spans:
[Parsing_Error: 9.] [Person: Women] currently using [Drug: narcotics]